Clinical trial exclusion criterion:
Clinically significant abnormalities of glucose metabolism

Annotated entities:
- Qualifier: "Clinically significant"
- Condition: "abnormalities of glucose metabolism"